Clinical trial exclusion criterion:
Antibiotic treatment or routine use of oral antiseptics in the previous 3 months.

Annotated entities:
- Drug: "Antibiotic"
- Multiplier: "routine use"
- Drug: "oral antiseptics"
- Temporal: "in the previous 3 months"